有關小型肝癌（small hepatocellular carcinoma）患者抽血檢	，下列何者正確？
A. AFP（甲型胎兒蛋白、alfa-fetoprotein）一定大於320 ng/mL
B. 約1/3患者AFP（甲型胎兒蛋白、alfa-fetoprotein）正常
C. 肝發炎指數（AST、ALT）一定正常
D. AFP（甲型胎兒蛋白、alfa-fetoprotein）一定正常

正確答案：B. 約1/3患者AFP（甲型胎兒蛋白、alfa-fetoprotein）正常